Describe DeepTRIAGE

DeepTRIAGE is an algorithm that uses machine learning to classify breast cancer sub-types. Basically, it takes a bunch of different subtypes of breast cancer, each with a distinct molecular signature that correlates with patient prognosis, and gives a score that describes how important each gene is in predicting the sub-type for each sample.